Which gene mutations cause the Marfan syndrome?

Marfan syndrome (MFS) is an autosomal dominant disorder caused by mutations in the fibrillin 1 gene (FBN1).